Subjects who have received any HDAC inhibitors other than valproic acid

The above is a clinical trial exclusion criterion. Annotated with entity spans:
Subjects who have received any [Drug: HDAC inhibitors] [Negation: other than] [Drug: valproic acid]